下列關於胎兒磁振造影的敘述，何者錯誤？
A. 胎兒磁振造影不適用顯影劑
B. 胎兒磁振造影不適合應用於胎兒體部的異常偵測
C. 懷孕前期 3 個月胎兒不適合施行胎兒磁振造影
D. 目前關於高磁場與噪音對於胎兒的影響仍有疑慮

正確答案：B. 胎兒磁振造影不適合應用於胎兒體部的異常偵測